List viral vectors used in gene therapy.

adeno-associated viruses
lentiviruses
herpes simplex viral vector